severe coronary artery disease, heart failure, kidney failure

The above is a clinical trial exclusion criterion. Annotated with entity spans:
[Qualifier: severe] [Condition: coronary artery disease], [Condition: heart failure], [Condition: kidney failure]